Any diagnosis requiring anti-coagulation

The above is a clinical trial exclusion criterion. Annotated with entity spans:
Any diagnosis requiring [Drug: anti-coagulation]